Patient having received oral and written information on the study, without any objections for the use of his/her personal data, and having signed a written Informed Consent Form.

The above is a clinical trial inclusion criterion. Annotated with entity spans:
[Non-query-able: Patient having received oral and written information on the study, without any objections for the use of his/her personal data, and having signed a written Informed Consent Form].